Clinical trial inclusion criterion:
Spontaneous breathing activity of at least 6 breaths/minute

Entity relations:
- Has_value("Spontaneous breathing activity", "at least 6 breaths/minute")